Clinical trial exclusion criterion:
Previous or concurrent hormonal management of prostate cancer

Entity relations:
- AND("hormonal management", "prostate cancer")